Clinical trial exclusion criterion:
Patient subjected to chemical or radiotherapy

Entity relations:
- OR("chemical", "radiotherapy")